An ECOG PS score of between 0 and 1;

The above is a clinical trial inclusion criterion. Annotated with entity spans:
An [Measurement: ECOG PS] score of [Value: between 0 and 1];